鬱血性心臟衰竭（congestive heart failure）病患合併有肺水腫（pulmonary edema），下列敘述何者錯誤？
A. 肺微血管壓力增加
B. 頸靜脈壓力增加
C. 平躺後可使症狀減輕
D. 嚴重時會影響肺泡之氣體交換

正確答案：C. 平躺後可使症狀減輕